History of alcoholism, drug abuse, psychiatric, psychological or other emotional problems that are likely to invalidate informed consent

The above is a clinical trial exclusion criterion. Annotated with entity spans:
History of [Condition: alcoholism], [Condition: drug abuse], [Condition: psychiatric], [Condition: psychological] or other [Condition: emotional problems] that are likely to invalidate informed consent